關於染色體核型（Karyotyping），下列敘述何者錯誤？
A. 正常男性染色體核型為46,XY
B. 47,XXY即為Klinefelter syndrome
C. 45,X為女性表徵，病人容易有Premature ovarian failure
D. 46,XY,del(5)(p12)指的是第五號染色體的長臂發生了Deletion

正確答案：D. 46,XY,del(5)(p12)指的是第五號染色體的長臂發生了Deletion